下列有關 emphysema 的手術敘述，何者錯誤？
A. 因外科手術之危險性不低，故只有臨床上已出現 dyspnea 症狀的病患才建議手術
B. 手術方式主要是切除 large bullae，儘量保存好的肺組織
C. 手術的危險性與病患的年齡和疾病的嚴重程度有密切相關
D. 血胸（hemothorax）為術後最常見之併發症

正確答案：D. 血胸（hemothorax）為術後最常見之併發症